Clinical trial inclusion criterion:
CHADS2 score = 2 or CHA2DS2-VASc score (=3)

Entity relations:
- Has_value("CHADS2 score", "= 2")
- Has_value("CHA2DS2-VASc score", "=3")
- OR("CHADS2 score", "CHA2DS2-VASc score")